下列何者穿過橫膈中央腱（central tendon of diaphragm）？
A. 主動脈
B. 下腔靜脈
C. 食道
D. 肝門靜脈

正確答案：B. 下腔靜脈